Renal transplants from HLA-identical sibling.

The above is a clinical trial exclusion criterion. Annotated with entity spans:
[Procedure: Renal transplants] from [Qualifier: HLA-identical sibling].